Patients with chronic conditions that would limit our ability to develop the study according to objectives, such as neurodevelopmental conditions preventing patients from understanding the Oucher tool

The above is a clinical trial exclusion criterion. Annotated with entity spans:
Patients with [Condition: chronic conditions] that would [Observation: limit our ability to develop the study according to objectives], such as [Condition: neurodevelopmental conditions] [Condition: preventing] patients from [Observation: understanding the Oucher tool]